Clinical trial exclusion criterion:
Patients with prolonged QT-time or other serious cardiac diseases.

Annotated entities:
- Condition: "prolonged QT-time"
- Qualifier: "other"
- Condition: "serious cardiac diseases"